痙攣型腦性麻痺病童最常發生半脫位或脫位的是下列那一個關節？
A. 髖
B. 膝
C. 肩
D. 肘

正確答案：A. 髖